下列何者不附著於會陰體（perineal body）？
A. 肛門外括約肌（external anal sphincter）
B. 球海綿體肌（bulbospongiosus）
C. 提肛肌（levator ani）
D. 坐骨海綿體肌（ischiocavernosus）

正確答案：D. 坐骨海綿體肌（ischiocavernosus）